Clinical trial exclusion criterion:
Subjects were not to have donated blood within 90 days prior to study initiation.

Annotated entities:
- Procedure: "donated blood"
- Negation: "not"
- Temporal: "within 90 days prior to study initiation"
- Reference_point: "study initiation"